Clinical trial inclusion criterion:
Has a body mass index >27 and <47 kg/m2.

Entity relations:
- Has_value("body mass index", ">27 and <47 kg/m2")